Clinical trial inclusion criteria:
Have diagnosis of prostate cancer and have received treatment with GnRH agonist or antagonist therapy for at least 1 month prior to enrollment.
Willing and able to complete survey questionnaires in English without assistance through the duration of the study. This stipulation is in place because not all of the proposed quality of life or cognitive tests are available or validated in other languages.
Age = 18 years.
Ability to understand and the willingness to sign a written informed consent document written in English that is approved by an institutional review board.
Have either newly diagnosed metastatic hormone sensitive prostate cancer (mHSPC) or castration-resistant metastatic prostate cancer (mCRPC) and eligible to undergo treatment with abiraterone acetate (mHSPC or mCRPC) or enzalutamide (mCRPC)
Patients may have received the following prior AR directed therapy prior to enrollment: bicalutamide, ketoconazole. Prior to enrollment, patients may have received treatment with abiraterone acetate or enzalutamide for no more than 14 days before completing baseline studies.
Patients may have received chemotherapy for hormone-sensitive metastatic prostate cancer only, but it must not have lasted for more than 6 months. At least 12 months must have elapsed since completion of chemotherapy.
Patients may have received prior definitive radiation therapy or surgery. At least 60 days must have elapsed since completion of definitive radiation therapy or surgery and patient must have only grade 2 or less adverse effects at the time of registration. Enrollment during palliative radiation of = 10 days, or radiation of = 10 days during the duration of the study is allowed.
Patients must be able to take oral medication.

Annotated entities:
- Condition: "prostate cancer"
- Drug: "GnRH agonist"
- Drug: "GnRH antagonist"
- Multiplier: "for at least 1 month"
- Temporal: "prior to enrollment"
- Procedure: "treatment"
- Non-query-able: "Willing and able to complete survey questionnaires in English without assistance through the duration of the study. This stipulation is in place because not all of the proposed quality of life or cognitive tests are available or validated in other languages."
- Person: "Age"
- Value: "= 18 years"
- Non-query-able: "Ability to understand and the willingness to sign a written informed consent document written in English that is approved by an institutional review board."
- Qualifier: "metastatic"
- Qualifier: "hormone sensitive"
- Condition: "prostate cancer"
- Condition: "mHSPC"
- Qualifier: "castration-resistant"
- Qualifier: "metastatic"
- Condition: "prostate cancer"
- Condition: "mCRPC"
- Drug: "abiraterone acetate"
- Procedure: "treatment"
- Condition: "mHSPC"
- Condition: "mCRPC"
- Drug: "enzalutamide"
- Condition: "mCRPC"
- Procedure: "chemotherapy"
- Qualifier: "hormone-sensitive"
- Qualifier: "metastatic"
- Condition: "prostate cancer"
- Multiplier: "lasted for more than 6 months"
- Negation: "not"
- Temporal: "At least 12 months must have elapsed since completion of chemotherapy"
- Reference_point: "completion of chemotherapy"
- Procedure: "chemotherapy"
- Temporal: "prior"
- Qualifier: "definitive"
- Procedure: "radiation therapy"
- Procedure: "surgery"
- Temporal: "At least 60 days must have elapsed since completion of definitive radiation therapy or surgery"
- Procedure: "radiation therapy"
- Procedure: "surgery"
- Qualifier: "definitive"
- Reference_point: "completion of definitive radiation therapy or surgery"
- Qualifier: "grade 2 or less"
- Condition: "adverse effects"
- Temporal: "at the time of registration"
- Non-representable: "Enrollment during palliative radiation of = 10 days, or radiation of = 10 days during the duration of the study is allowed."
- Non-query-able: "Patients must be able to take oral medication"